關於痛風（gout）和急性痛風性關節炎（acute gouty arthritis）的治療，下列敘述何者錯誤？
A. 急性痛風性關節炎如果不治療也可在3至10天內自然緩解
B. 治療急性痛風性關節炎時，如合併使用colchicine和降尿酸的藥物（例如allopurinol），會有最好的消炎效果
C. 使用allopurinol治療痛風時，病人如果帶有HLA-B*5801基因，則產生嚴重皮膚過敏反應的機率比不帶此基因的機率高很多
D. Febuxostat是一種xanthine oxidase inhibitor，在腎臟功能不全的病人也可使用

正確答案：B. 治療急性痛風性關節炎時，如合併使用colchicine和降尿酸的藥物（例如allopurinol），會有最好的消炎效果